Clinical trial exclusion criterion:
Pregnancy, coagulopathy, allergy to bupivacaine, renal failure, hepatic insufficiency, and/or inappropriate candidate for usual therapy (specifically, if unable to receive the usual preoperative interscalene nerve block: preexisting nerve injury on side of surgery, refusal of nerve block, infection at site of nerve block).

Annotated entities:
- Condition: "Pregnancy"
- Condition: "coagulopathy"
- Condition: "allergy"
- Drug: "bupivacaine"
- Condition: "renal failure"
- Condition: "hepatic insufficiency"
- Condition: "inappropriate candidate"
- Procedure: "usual therapy"
- Mood: "unable to receive"
- Procedure: "preoperative interscalene nerve block"
- Temporal: "preexisting"
- Condition: "nerve injury"
- Qualifier: "side of surgery"
- Condition: "refusal of nerve block"
- Condition: "infection"
- Qualifier: "site of nerve block"